Clinical trial exclusion criterion:
No Beta-Blockers

Entity relations:
- Has_negation("Beta-Blockers", "No")